Clinical trial inclusion criterion:
Patients in the cardiothoracic intensive care after cardiac surgery with cardiopulmonary bypass

Entity relations:
- multi("cardiac surgery with cardiopulmonary bypass", "cardiac surgery")
- Has_index("after cardiac surgery with cardiopulmonary bypass", "cardiac surgery with cardiopulmonary bypass")
- AND("cardiac surgery", "cardiopulmonary bypass")
- Has_temporal("cardiothoracic intensive care", "after cardiac surgery with cardiopulmonary bypass")